¿Cuál de las siguientes técnicas se incluye en el programa de Reducción del Estrés Basado en Mindfulness (MBSR) propuesto por KabatZinn?:
1. La activación diferencial.
2. La autoexploración corporal.
3. El modo hacer.
4. La defunción cognitiva.

Respuesta correcta: 2. La autoexploración corporal.